Glioblastoma multiforme（GBM）屬於WHO classification system of glioma中的：
A. Grade Ⅰ
B. Grade Ⅱ
C. Grade Ⅲ
D. Grade Ⅳ

正確答案：D. Grade Ⅳ